Clinical trial inclusion criterion:
Patients with central nervous system disease are eligible for enrollment if they have received prior radiotherapy or surgery to sites of CNS metastatic disease and are without evidence of clinical progression for at least 4 weeks prior to screening, have no evidence of new or enlarging brain metastases, and are off steroids for at least 7 days before first dose of pembrolizumab.

Annotated entities:
- Condition: "central nervous system disease"
- Procedure: "radiotherapy"
- Procedure: "surgery"
- Condition: "CNS metastatic disease"
- Condition: "clinical progression"
- Negation: "without"
- Temporal: "for at least 4 weeks prior to screening"
- Reference_point: "screening"
- Condition: "brain metastases"
- Qualifier: "enlarging"
- Qualifier: "new"
- Negation: "no"
- Drug: "steroids"
- Negation: "off"
- Temporal: "for at least 7 days before first dose of pembrolizumab"
- Reference_point: "first dose of pembrolizumab"
- Drug: "pembrolizumab"